Clinical trial exclusion criterion:
Patients with a history (= 12 months) of acute coronary syndrome receiving dual antiplatelet therapy, or patients receiving monotherapy with aspirin.

Annotated entities:
- Temporal: "history"
- Temporal: "= 12 months"
- Condition: "acute coronary syndrome"
- Procedure: "dual antiplatelet therapy"
- Procedure: "monotherapy"
- Drug: "aspirin"